Clinical trial inclusion criterion:
reports commercial sex work

Annotated entities:
- Observation: "commercial sex work"